Clinical trial inclusion criterion:
HLA-A2 melanoma patients with :

Annotated entities:
- Condition: "melanoma"
- Qualifier: "HLA-A2"